Duodenum 的 malignant lesions 中，下列何者最常見？
A. Adenocarcinoma
B. Lymphoma
C. Leiomyosarcoma
D. Metastasis

正確答案：A. Adenocarcinoma